Clinical trial inclusion criterion:
women undergoing IVF/ICSI or frozen embryo transfers (FET) that less than 40 years old.

Entity relations:
- Has_value("old", "less than 40 years")
- OR("IVF", "ICSI", "frozen embryo transfers (FET)")